Patients in whom TIMI-3 flow was not able to be established after wire crossing, balloon angioplasty or thrombectomy.

The above is a clinical trial exclusion criterion. Annotated with entity spans:
[Non-representable: Patients in whom TIMI-3 flow was not able to be established after wire crossing, balloon angioplasty or thrombectomy.]